skin infection in proximity of injection site

The above is a clinical trial exclusion criterion. Annotated with entity spans:
[Condition: skin infection] in proximity of [Qualifier: injection site]